Los viriones de los Arenavirus contienen:
1. Una molécula de RNA lineal monocatenario.
2. Dos moléculas iguales de RNA lineal bicatenario.
3. Dos moléculas distintas de RNA lineal monocatenario.
4. Dos moléculas distintas de RNA circular monocatenario.
5. Dos moléculas idénticas de RNA circular monocatenario.

Respuesta correcta: 4. Dos moléculas distintas de RNA circular monocatenario.